Demonstrate a positive cough stress test during complex multi-channel urodynamic testing

The above is a clinical trial inclusion criterion. Annotated with entity spans:
Demonstrate a [Value: positive] [Measurement: cough stress test] during [Procedure: complex multi-channel urodynamic testing]